What are DMARDs?

Treatment with disease-modifying antirheumatic drugs (DMARDs)